History of corticosteroid injection to affected shoulder within the last 3 months

The above is a clinical trial exclusion criterion. Annotated with entity spans:
[Temporal: History of] [Procedure: corticosteroid injection] to affected [Qualifier: shoulder] within the [Temporal: last 3 months]